Clinical trial exclusion criterion:
Uncontrolled hypertension;

Entity relations:
- Has_qualifier("hypertension", "Uncontrolled")